What is the treatment of subacute thyroiditis?

Common treatment of  subacute thyroiditis is with anti-inflammatory drug agents, namely corticosteroids